Clinical trial exclusion criterion:
Subjects with a significant risk of violent behaviour or a significant risk of committing suicide based on history or investigator's judgment.

Entity relations:
- Has_mood("violent behaviour", "significant risk")
- Has_mood("committing suicide", "significant risk")
- OR("violent behaviour", "committing suicide")